Clinical trial inclusion criterion:
First single stroke ischaemic or haemorrhagic responsible of an hemiplegia

Entity relations:
- Has_qualifier("stroke", "ischaemic")
- Has_multiplier("stroke", "single")
- Has_multiplier("stroke", "First")
- AND("stroke", "hemiplegia")
- OR("ischaemic", "haemorrhagic")